Clinical trial exclusion criterion:
History of statin intolerance with drug interaction to antiretroviral drugs.

Entity relations:
- AND("intolerance", "statin")